一位32歲女性，體重60 kg，騎機車不慎被貨車撞到造成腹內出血，送至急診時初步檢查為心縮壓（systolic  blood pressure）正常，但脈搏壓（pulse pressure）明顯下降，且心跳112下/分，尿量20-30 ml/hour。此病人約流失多少血液？
A. 500 ml
B. 700-1100 ml
C. 1300-1700 ml
D. 1900-2300 ml

正確答案：B. 700-1100 ml